P. L. es un paciente diagnosticado de cáncer broncopulmonar al que se le han prescrito fármacos antineoplásicos. ¿Cuál de las siguientes afirmaciones respecto a la administración de quimioterapia es INCORRECTA?:
1. Los fármacos vesicantes se administrarán con conexión en “Y” a un suero fisiológico.
2. Se evitará la administración del fármaco en las venas del dorso de la mano y fosa antecubital.
3. Si hay extravasación, se tiene que interrumpir inmediatamente la infusión y retirar siempre el catéter.
4. Se alternarán los lugares de punción en cada ciclo.
5. Se recomienda utilizar las venas del antebrazo siempre que sean de buen calibre, evitando las de trayecto sinuoso.

Respuesta correcta: 3. Si hay extravasación, se tiene que interrumpir inmediatamente la infusión y retirar siempre el catéter.